Clinical trial exclusion criterion:
Uncontrolled hypertension (medication non-compliance or past 3 months with a diastolic reading of 105 as verified by compartment pressure of the rectus sheath (CPRS))

Entity relations:
- Has_qualifier("Uncontrolled hypertension", "Uncontrolled")
- Has_value("diastolic reading", "105")
- AND("as verified by compartment pressure of the rectus sheath (CPRS)", "compartment pressure of the rectus sheath (CPRS)")
- Has_qualifier("diastolic reading", "as verified by compartment pressure of the rectus sheath (CPRS)")
- Has_temporal("medication non-compliance", "past 3 months")
- AND("Uncontrolled hypertension", "medication non-compliance")
- AND("Uncontrolled hypertension", "diastolic reading")